Cardiac arrhythmias (2nd and 3rd degree heart block or premature ventricular complexes in Lown classes 4 or 5)

The above is a clinical trial exclusion criterion. Annotated with entity spans:
[Condition: Cardiac arrhythmia]s ([Condition: 2nd] and [Condition: 3rd degree heart block] or [Condition: premature ventricular complexes] in [Qualifier: Lown classes 4] or 5)